Identified as a natural or adopted child of the Investigator or employee with direct involvement in the proposed study

The above is a clinical trial exclusion criterion. Annotated with entity spans:
[Non-query-able: Identified as a natural or adopted child of the Investigator or employee with direct involvement in the proposed study]